Able to walk unassisted

The above is a clinical trial inclusion criterion. Annotated with entity spans:
[Mood: Able to] [Procedure: walk unassisted]